Invasive knee treatments with hyaluronic acid infusion, corticosteroids and anaesthetics, in the target knee, up to 6 months previous to study inclusion.

The above is a clinical trial exclusion criterion. Annotated with entity spans:
[Procedure: Invasive knee treatments] with [Procedure: hyaluronic acid infusion], [Drug: corticosteroids] and [Drug: anaesthetics], in the [Reference_point: target knee], [Temporal: up to 6 months previous] to [Reference_point: study inclusion].